Any condition that, in the opinion of the study physician, makes it medically inappropriate or risky for the patient to enroll in the trial

The above is a clinical trial exclusion criterion. Annotated with entity spans:
[Post-eligibility: Any condition that, in the opinion of the study physician, makes it medically inappropriate or risky for the patient to enroll in the trial]